¿Qué suministra la vía de las pentosas fosfato?:
1. Ribosa para la síntesis de ácidos nucleícos.
2. Glicerol para la síntesis de triglicéridos.
3. NADH para el ciclo redox del glutatión.
4. Glucosa-1-fosfato para la síntesis de glucógeno.

Respuesta correcta: 1. Ribosa para la síntesis de ácidos nucleícos.